Clinical trial exclusion criterion:
4. inability to comply with follow-up criteria

Annotated entities:
- Post-eligibility: "inability to comply with follow-up criteria"
- Subjective_judgement: "inability to comply with follow-up criteria"
- Non-query-able: "inability to comply with follow-up criteria"